遺傳性的orotic aciduria疾病會造成嚴重的貧血及生長障礙，病患可以攝取下列何種物質加以治療？
A. uridine
B. thymine
C. adenosine
D. allopurinol

正確答案：A. uridine